Clinical trial exclusion criterion:
Serious organic or mental disease diagnosed by a psychiatrist (e.g., major depression currently treated with antidepressant medication) suspected on the basis of the medical history and/or clinical examination.

Annotated entities:
- Condition: "mental disease"
- Condition: "organic disease"
- Qualifier: "diagnosed by a psychiatrist"
- Condition: "major depression"
- Procedure: "treated"
- Temporal: "currently"
- Drug: "antidepressant medication"
- Mood: "suspected"
- Temporal: "medical history"
- Procedure: "clinical examination"